Clinical trial inclusion criterion:
Initial WBC < 20,000/µL

Annotated entities:
- Line: "Initial WBC < 20,000/µL"
- Measurement: "WBC"
- Qualifier: "Initial"
- Value: "< 20,000/µL"